Clinical trial exclusion criterion:
Fulminant hepatic failure.

Entity relations:
- Has_qualifier("hepatic failure", "Fulminant")